急性鼻竇炎引起之頭痛，如果多發生於白天，到下午或傍晚則漸緩，則最常見之原因為何？
A. 篩竇炎
B. 蝶竇炎
C. 額竇炎
D. 上頜竇與篩竇炎

正確答案：C. 額竇炎